Las infecciones causadas por Clostridium tetani, Bordetella pertussis, Corynebacterium diphtheriae y Vibrio cholerae tienen en común:
1. El tipo de transmisión.
2. El reservorio.
3. La producción de exotoxinas.
4. Los órganos afectados.
5. La vía de infección.

Respuesta correcta: 3. La producción de exotoxinas.